The American Society of Anesthesiologists (ASA) score > 3

The above is a clinical trial exclusion criterion. Annotated with entity spans:
The [Measurement: American Society of Anesthesiologists (ASA) score] [Value: > 3]